Which subcortical brain structure is influenced the most by common genetic variants?

The putamen is the most influenced by common genetic variants. It is the subcortical brain structure responsible for learning, memory and motivation.